下列何者是人體肝臟產生的膽汁中，膽紅素（bilirubin）的來源？
A. 膽鹽（bile salts）
B. 血紅素（hemoglobin）
C. 血清素（serotonin）
D. 膽固醇（cholesterol）

正確答案：B. 血紅素（hemoglobin）